Clinical trial exclusion criterion:
Patients who are unable or do not have the necessary assistance to operate the patient remote

Annotated entities:
- Non-query-able: "Patients who are unable or do not have the necessary assistance to operate the patient remote"